Clinical trial exclusion criterion:
Other invasive malignancies within 5 years prior to Day 1

Entity relations:
- Has_index("within 5 years prior to Day 1", "Day 1")
- Has_qualifier("invasive malignancies", "Other")
- Has_temporal("invasive malignancies", "within 5 years prior to Day 1")